72 歲男性，有多年高血壓病史，來診時主訴左下肢疼痛麻木達 3 小時。病人過去一天一包菸持續超過 40 年，理學檢查發現左足部冰冷，顏色蒼白，未見腳部腫脹，但足部脈搏微弱。病人有多年雙側下肢靜脈曲張的疾病史，未服用藥物控制。病人血壓 180/110 mmHg，心跳 100/min，抽血時血糖值 220 mg/dL。此病人最可能的診斷是：
A. 下肢動脈堵塞（lower limb arterial occlusion）
B. 下肢靜脈堵塞（lower limb venous occlusion）
C. 下肢鬱血靜脈炎（stasis dermatitis）
D. 下肢動脈瘤（lower limb arterial aneurysm）

正確答案：A. 下肢動脈堵塞（lower limb arterial occlusion）